Clinical trial exclusion criterion:
positive drug screen or alcohol breathalyzer

Annotated entities:
- Measurement: "drug screen"
- Value: "positive"
- Measurement: "alcohol breathalyzer"